Clinical trial exclusion criterion:
Positive urine drug screen for cannabinoids and other potential abuse substances (e.g. alcohol, cocaine, amphetamines and methamphetamines, unprescribed opioids)

Entity relations:
- Has_value("urine drug screen", "Positive")
- Has_qualifier("opioids", "unprescribed")
- AND("Positive", "cannabinoids")
- OR("cannabinoids", "cocaine", "amphetamines", "methamphetamines", "opioids", "alcohol")